下列何者不是 Mifepristone（RU 486）之作用？
A. Antiprogesterone
B. Antiestrogen
C. Antiandrogen
D. Antiglucocorticoid

正確答案：B. Antiestrogen